Clinical trial inclusion criterion:
Life expectancy of >12 weeks.

Entity relations:
- Has_value("Life expectancy", ">12 weeks")